新藥上市前，主要以何種研究設計評估其臨床治療效果？
A. 成功病例報告
B. 病例對照研究
C. 隨機分派試
D. 世代追蹤研究

正確答案：C. 隨機分派試